Clinical trial exclusion criterion:
contra-indication to nicotine replacement therapy

Annotated entities:
- Condition: "contra-indication"
- Procedure: "nicotine replacement therapy"